Clinical trial exclusion criterion:
Patients with serious and unstable illnesses including current hepatic, renal, gastroenterologic, respiratory, cardiovascular (including ischemic heart disease and congestive heart failure), endocrinologic, neurologic (including stroke, transient ischemic attack, subarachnoidal bleeding, brain tumor, encephalopathy, and meningitis).

Entity relations:
- Subsumes("neurologic", "stroke")
- Subsumes("cardiovascular", "ischemic heart disease")
- Has_qualifier("hepatic", "serious")
- AND("serious", "unstable")
- OR("hepatic", "renal", "gastroenterologic", "respiratory", "cardiovascular", "endocrinologic", "neurologic")
- OR("ischemic heart disease", "congestive heart failure")
- OR("stroke", "transient ischemic attack", "subarachnoidal bleeding", "brain tumor", "encephalopathy", "meningitis")